Clinical trial exclusion criterion:
Patients who were smokers

Annotated entities:
- Condition: "smokers"